Clinical trial exclusion criterion:
Concomitant drug therapy known to cause significant enzyme induction or inhibition of CYP 3A4.

Annotated entities:
- Measurement: "drug therapy"
- Temporal: "Concomitant"
- Observation: "enzyme induction of CYP 3A4"
- Observation: "enzyme inhibition of CYP 3A4"